Psychiatric troubles

The above is a clinical trial exclusion criterion. Annotated with entity spans:
[Condition: Psychiatric troubles]